Clinical trial exclusion criterion:
Women who are pregnant or lactating

Annotated entities:
- Person: "Women"
- Condition: "pregnant"
- Condition: "lactating"